Contraindications for BB.

The above is a clinical trial exclusion criterion. Annotated with entity spans:
[Condition: Contraindications] for [Drug: BB].